Primary renal disease

The above is a clinical trial exclusion criterion. Annotated with entity spans:
[Condition: Primary renal disease]